Clinical trial inclusion criterion:
Written informed consent

Annotated entities:
- Post-eligibility: "Written informed consent"
- Non-query-able: "Written informed consent"